Clinical trial exclusion criterion:
Estimated CrCl < 60 mL/min

Entity relations:
- Has_value("Estimated CrCl", "< 60 mL/min")